Clinical trial inclusion criterion:
Normal range for their height and weight. Weight and height measurements should fall within the percentile range 3-97% of normal values for age according to Danish growth charts.

Entity relations:
- Has_value("height", "Normal range")
- Has_value("weight", "Normal range")